Clinical trial inclusion criterion:
the last vaccination intervals = 14 days and the last attenuated live vaccine intervals = 28 days

Annotated entities:
- Value: "= 28 days"
- Observation: "last attenuated live vaccine intervals"
- Observation: "last vaccination intervals"
- Value: "= 14 days"